有關發育不良痣（dysplastic nevi）的敘述，下列何者正確？
A. 通常較一般的痣（nevi）小，常小於5mm
B. 只見於曬到陽光的皮膚
C. 組織形態通常是皮內痣（intradermal nevi）
D. 大部分此類病灶都不會轉變成黑色素瘤（melanoma）

正確答案：D. 大部分此類病灶都不會轉變成黑色素瘤（melanoma）